La trazabilidad de un método analítico se puede demostrar:
1. Realizando el estudio de la selectividad del mismo.
2. Mediante comparación con un método de referencia, empleo de materiales de referencia certificados y/o análisis de muestras adicionadas.
3. Comprobando que el límite de detección del mismo es muy bajo.
4. Evaluando la linealidad de la calibración, cuyo criterio más apropiado es el coeficiente de correlación.
5. Haciendo medidas replicadas de los patrones y llevar a cabo el análisis de la varianza.

Respuesta correcta: 2. Mediante comparación con un método de referencia, empleo de materiales de referencia certificados y/o análisis de muestras adicionadas.